Clinical trial exclusion criterion:
1. Patients with lumbar common diseases(e.g., Lumbar disc, Lumbar spinal stenosis, Lumbar slippage, etc)

Entity relations:
- Subsumes("lumbar diseases", "Lumbar disc")
- OR("Lumbar disc", "Lumbar spinal stenosis", "Lumbar slippage")